depression, antidepressant drugs treatment

The above is a clinical trial exclusion criterion. Annotated with entity spans:
[Condition: depression], [Drug: antidepressant drugs] treatment